Clinical trial inclusion criterion:
The patients present with operable unilateral invasive breast cancers without distant metastasis(stage I, II, and III)

Annotated entities:
- Qualifier: "operable"
- Qualifier: "unilateral"
- Qualifier: "invasive"
- Condition: "breast cancers"
- Condition: "distant metastasis"
- Negation: "without"
- Measurement: "stage"
- Value: "I, II, and III"